大量失血時，身體透過許多機轉引起口渴而增加飲水量，以下何者是合理機轉？
A. 體液之 osmolarity 改變，活化下視丘之 osmoreceptor 而引發口渴
B. 血壓下降，活化位於心臟及血管壁之 baroreceptor，最後訊號透過下視丘引發口渴
C. 增加 renin 之釋放，renin 作用於下視丘引發口渴
D. 血液中 angiotensin II 的濃度增加，並作用於 subfornical organ（位於 diencephalon），最後訊號透過下視丘引發口渴

正確答案：D. 血液中 angiotensin II 的濃度增加，並作用於 subfornical organ（位於 diencephalon），最後訊號透過下視丘引發口渴